Clinical trial inclusion criterion:
Not seeking pregnancy during the study period

Annotated entities:
- Pregnancy_considerations: "Not seeking pregnancy during the study period"